PDR patients requiring surgical intervention for complications of vitreous hemorrhage or traction retinal detachment and pre-operative IVC treatment.

The above is a clinical trial inclusion criterion. Annotated with entity spans:
[Condition: PDR] patients [Mood: requiring] [Procedure: surgical intervention] for complications of [Condition: vitreous hemorrhage] or [Condition: traction retinal detachment] and [Qualifier: pre-operative] [Procedure: IVC treatment].